What is BEL(Biological Expression Language) used for?

Biological expression language (BEL) is a syntax representation allowing for the structured representation of a broad range of biological relationships.